Clinical trial exclusion criterion:
Asplenia (absence of spleen or its removal);

Entity relations:
- Has_negation("spleen", "absence of")
- Subsumes("Asplenia", "spleen")
- OR("spleen", "spleen removal")